如果把真核細胞的一段基因嵌入 E. coli DNA 中，卻無法表現此真核蛋白質，原因可能是？
A. 原核細胞和真核細胞的遺傳密碼不同
B. 原核細胞只可以轉譯 polycistronic mRNA
C. E. coli 無法移除 introns
D. E. coli RNA polymerase 不能把真核 DNA 轉錄成 mRNA

正確答案：C. E. coli 無法移除 introns